Clinical trial exclusion criterion:
Evidence of intoxication or withdrawal during the screening evaluation

Annotated entities:
- Condition: "intoxication"
- Condition: "withdrawal"